What disease is associated with Anticitrullinated peptide antibodies (ACPAs)?

nticitrullinated protein antibodies (ACPAs) are serological biomarkers associated with early, rapidly progressing rheumatoid arthritis (RA)